Clinical trial exclusion criterion:
Receipt of chemotherapy for prostate or other cancer within the past 12 months with residual cognitive deficits, or receipt of chemotherapy for mCRPC. Patients/physicians planning treatment with chemotherapy during the 12 month period of the investigation are also ineligible.

Annotated entities:
- Procedure: "chemotherapy"
- Condition: "prostate cancer"
- Qualifier: "other"
- Condition: "cancer"
- Temporal: "within the past 12 months"
- Condition: "residual cognitive deficits"
- Procedure: "chemotherapy"
- Condition: "mCRPC"
- Non-representable: "Patients/physicians planning treatment with chemotherapy during the 12 month period of the investigation are also ineligible."